Clinical trial inclusion criteria:
ASA physical status I-III;
18-85 years of age, inclusive;
surgery less than 3 hours.

Annotated entities:
- Measurement: "ASA physical status"
- Value: "I-III"
- Value: "18-85 years , inclusive"
- Person: "age"
- Measurement: "surgery"
- Temporal: "less than 3 hours"